Clinical trial inclusion criterion:
Stenosis of more than 50% in femoropopliteal artery

Entity relations:
- Has_value("Stenosis", "more than 50%")
- Has_qualifier("Stenosis", "femoropopliteal artery")